Clinical trial inclusion criterion:
Creatinine clearance (CLcr) = 60 mL /min, as calculated by the Cockcroft-Gault equation

Entity relations:
- Has_value("Creatinine clearance (CLcr)", "= 60 mL /min")
- Has_qualifier("Creatinine clearance (CLcr)", "Cockcroft-Gault equation")